假設細胞膜只容許陽離子（cations）通透。經過一段時間後，通透的離子在細胞膜兩側將會形成一種特殊分布關係，此稱為：
A. Starling effect
B. Nernst equilibrium
C. Donnan effect
D. Bohr effect

正確答案：B. Nernst equilibrium